Patients unable to give consent

The above is a clinical trial exclusion criterion. Annotated with entity spans:
[Informed_consent: Patients unable to give consent]